甲狀腺切除手術不慎傷及喉外神經（external laryngeal nerve），下列何肌的功能最可能受損？
A. 環狀甲骨肌（cricothyroid muscle）
B. 甲狀杓骨肌（thyroarytenoid muscle）
C. 後環杓肌（posterior cricoarytenoid muscle）
D. 外側環杓肌（lateral cricoarytenoid muscle）

正確答案：A. 環狀甲骨肌（cricothyroid muscle）